有一 67 歲婦女因頭痛、嘔吐住院，過去史有糖尿病超過 10 年，病人有 3 個小孩，第一次及第三次生產後發生產褥熱，但並無出血或血壓降低之情形，第一及第二個小孩皆有哺乳，第三個小孩無法哺乳，且此後無月經（當年 26 歲），以下血液檢查結果那一個符合此病例情形？
A. FSH 50 mIU/mL、LH 50 mIU/mL、Prolactin 20 ng/mL
B. FSH 2.0 mIU/mL、LH 1.0 mIU/mL、Prolactin 100 ng/mL
C. FSH 2.0 mIU/mL、LH 1.0 mIU/mL、Prolactin 2 ng/mL
D. FSH 50 mIU/mL、LH 2.0 mIU/mL、Prolactin 15 ng/mL

正確答案：C. FSH 2.0 mIU/mL、LH 1.0 mIU/mL、Prolactin 2 ng/mL